Clinical trial exclusion criterion:
Household or other close/intimate contact(s) under the age of 12 months.

Annotated entities:
- Person: "close/intimate contact(s)"
- Person: "age"
- Value: "under 12 months"
- Person: "Household"